Clinical trial exclusion criterion:
designated ASA physical status 4 or above

Entity relations:
- Has_value("ASA physical status", "4 or above")